一名 4 歲大的小朋友，平時拒絕吃肉，勉強吃肉會嘔吐，在小兒心理門診追踪治療。該小朋友因為水痘（Varicella）、發燒及神智不清被送至急診，抽血檢查發現血液中氨（Ammonia）濃度偏高，進一步檢查發現病人的精胺酸酶（Arginase）基因異常。下列相關敘述何者正確？
A. 吃肉類食物將會改善他的症狀
B. 由於人體有腦血管屏障（Blood-brain barrier），所以氨不會進入腦部，因此神智不清應該不是氨所引起
C. 精胺酸酶之作用可直接產生尿素
D. 精胺酸酶是三羧酸循環（Tricarboxylic cycle）中的重要酵素

正確答案：C. 精胺酸酶之作用可直接產生尿素